Maternal or infant urine drug screen positive for methadone and/or opioids on admission

The above is a clinical trial inclusion criterion. Annotated with entity spans:
[Qualifier: Maternal] or [Qualifier: infant] [Measurement: urine drug screen] [Value: positive] for [Qualifier: methadone] and/or [Qualifier: opioids] on admission